patient with mild to severe carotid artery disease

The above is a clinical trial inclusion criterion. Annotated with entity spans:
patient with [Qualifier: mild] to [Qualifier: severe] [Condition: carotid artery disease]